使用組合型女性避孕藥，不能降低下列何者之發病率？
A. 卵巢癌
B. 子宮內膜癌
C. 乳癌
D. 異位懷孕

正確答案：C. 乳癌